一位 68 歲男性病人罹患糖尿病多年，現因發燒及全身倦怠被送至醫院，檢查時血壓 96/60 mmHg，體溫 3 mg/dL，ALT(GPT) 95 U/L， sugar 200 mg/dL，驗尿中白血球為 0-2/HPF，胸部X光檢查正常。接下來先做下列那一項檢查最恰當？
A. 鼻竇 X 光檢查
B. Gallium scan
C. 腹部超音波
D. 肺部高解析度電腦斷層攝影（HRCT）

正確答案：C. 腹部超音波